What percent of Rheumatoid Arthritis (RA) patients are not responding to anti-TNF therapy?

Anti-tumour necrosis factor (TNF) agents have revolutionized the treatment of patients with rheumatoid arthritis (RA). These therapies are, however, expensive and 30% of patients fail to respond. After 6 months, 18% had a good EULAR response, of whom 9% were considered to be in remission and 50% had a moderate response.